Entre las actividades de la enfermera para un paciente con deterioro cognitivo secundario a Accidente Vascular Cerebral, NO es correcto:
1. Reorientar al paciente en cuanto a tiempo, lugar y situación con frecuencia.
2. Utilizar claves verbales y auditivas para orientar al paciente.
3. Repetir y reforzar las instrucciones con frecuencia.
4. Evitar mostrarle objetos familiares para no contribuir a su frustración.
5. Utilizar un lenguaje simple.

Respuesta correcta: 4. Evitar mostrarle objetos familiares para no contribuir a su frustración.